Clinical trial exclusion criterion:
High blood pressure diagnosed by a doctor

Annotated entities:
- Condition: "High blood pressure"